2. Screening tool: Wechsler Abbreviated Scale of Intelligence.

The above is a clinical trial inclusion criterion. Annotated with entity spans:
[Parsing_Error: 2.] Screening tool: [Procedure: Wechsler Abbreviated Scale of Intelligence].